Patients older than 18 years

The above is a clinical trial inclusion criterion. Annotated with entity spans:
Patients [Value: older than 18] [Person: years]